Clinical trial inclusion criterion:
4. Patients with previous radiotherapy as definitive therapy for locally advanced non-small cell lung cancer are eligible, as long as the recurrence is outside the original radiation therapy port. Radiation therapy must have been completed >4 weeks prior to the initiation of study treatment. Patients who have received chemo/radiation for locally advanced NSCLC are not eligible. Patients who have received palliative radiation therapy for symptomatic metastases must have completed treatment >14 days prior the initiation of the study treatment.

Entity relations:
- Has_temporal("radiotherapy", "previous")
- Has_qualifier("non-small cell lung cancer", "locally advanced")
- AND("radiotherapy", "non-small cell lung cancer")
- multi(">4 weeks prior to the initiation of study treatment", "the initiation of study treatment")
- Has_temporal("Radiation therapy", ">4 weeks prior to the initiation of study treatment")
- Has_qualifier("NSCLC", "locally advanced")
- AND("chemo", "NSCLC")
- Has_negation("chemo", "not")
- multi("symptomatic metastases", "symptomatic")
- AND("palliative radiation therapy", "symptomatic metastases")
- multi(">14 days prior the initiation of the study treatment", "the initiation of the study treatment")
- OR("chemo", "radiation")